Which drugs are included in the CAPOX chemotherapy regimen for colorectal cancer?

CAPOX chemotherapy regimen for colorectal cancer includes capecitabine plus oxaliplatin.